3. Traumatic and non-traumatic, non-progressive lesions

The above is a clinical trial inclusion criterion. Annotated with entity spans:
[Parsing_Error: 3.] [Qualifier: Traumatic] and [Qualifier: non-traumatic], [Qualifier: non-progressive] [Condition: lesions]